有關鹽酸狄布卡因計數（Dibucaine number）之敘述，下列何者正確？
A. 鹽酸狄布卡因（Dibucaine）是一種局部麻醉劑（Local anesthetics），可抑制正常的膽鹼脂酶
B. 是指膽鹼脂酶（Cholinesterase）與假膽鹼脂酶（Pseudocholinesterase）的比例
C. 可以用來評估去極性肌肉鬆弛劑（Depolarizing neuromuscular blocking agents）的作用時間長短
D. 鹽酸狄布卡因計數（Dibucaine number）與假膽鹼脂酶（Pseudocholinesterase）的數量成正比

正確答案：C. 可以用來評估去極性肌肉鬆弛劑（Depolarizing neuromuscular blocking agents）的作用時間長短